Performance status of 0-1

The above is a clinical trial inclusion criterion. Annotated with entity spans:
[Measurement: Performance status] of [Value: 0-1]